La utilización del método de adición estándar en la calibración de un método de análisis instrumental se recomienda:
1. Siempre que sea posible.
2. Cuando se analizan muestras complejas en las que es probable que se produzcan efectos matriz importantes y se desea minimizarlos.
3. Cuando se quieren determinar concentraciones muy altas de analito.
4. Cuando se quiere utilizar un factor de dilución.
5. En las volumetrías ácido-base automatizadas.

Respuesta correcta: 2. Cuando se analizan muestras complejas en las que es probable que se produzcan efectos matriz importantes y se desea minimizarlos.